Clinical trial inclusion criterion:
Hemoglobin > 11g/dl,

Annotated entities:
- Measurement: "Hemoglobin"
- Value: "> 11g/dl"